Clinical trial exclusion criterion:
Clinically significant pericardial effusion (eg, moderate or larger or with hemodynamic compromise)

Annotated entities:
- Qualifier: "Clinically significant"
- Condition: "pericardial effusion"
- Qualifier: "moderate or larger"
- Condition: "hemodynamic compromise"